Clinical trial exclusion criterion:
Coronary-artery bypass graft, percutaneous intervention (e.g. cardiac, cerebrovascular, aortic; diagnostic catheters are allowed) or major surgery, including thoracic and cardiac surgery, within the last 3 months.

Entity relations:
- Has_index("within the last 3 months", "the last 3 months")
- Has_temporal("thoracic surgery", "within the last 3 months")
- Subsumes("major surgery", "thoracic surgery")
- OR("thoracic surgery", "cardiac surgery")
- OR("Coronary-artery bypass graft", "percutaneous intervention", "major surgery")